Clinical trial exclusion criterion:
Patients with a "currently active" second malignancy other than non-melanoma skin cancers are not eligible. Patients are not considered to have a "currently active" malignancy if they have completed all therapy and are now considered without evidence of disease for 1 year. Patients with cognitive dysfunction related to treatment of another malignancy, including a history of "chemo-brain", are ineligible.

Entity relations:
- Has_multiplier("malignancy", "second")
- Has_negation("non-melanoma skin cancers", "other than")
- AND("malignancy", "non-melanoma skin cancers")
- Has_qualifier("malignancy", "currently active")
- Has_qualifier("malignancy", "another")
- AND("treatment", "malignancy")
- AND("cognitive dysfunction", "treatment")
- OR("malignancy", "cognitive dysfunction")